Patients with acute throat diseases: pharyngitis, tonsillitis, pharyngotonsillitis

The above is a clinical trial inclusion criterion. Annotated with entity spans:
Patients with [Condition: acute throat diseases]: [Condition: pharyngitis], [Condition: tonsillitis], [Condition: pharyngotonsillitis]